胰島素（insulin）是身體控制血糖最重要的激素，給糖尿病患注射胰島素主要會發生下列何項反應？
A. 使 insulin receptor dimerization
B. Insulin receptor 磷酸化其受質，如 IRS-1
C. 抑制 protein kinase C
D. 抑制 protein kinase G

正確答案：B. Insulin receptor 磷酸化其受質，如 IRS-1